any medical or surgical intervention planned for the next 13 months after randomization not allowing study participation according to the investigator´s judgment

The above is a clinical trial exclusion criterion. Annotated with entity spans:
a[Non-query-able: ny medical or surgical intervention planned for the next 13 months after randomization not allowing study participation according to the investigator´s judgment]